關於臺灣全民健康保險對醫療服務供給影響的敘述，下列何者錯誤？
A. 規劃初期即確立保險的本質是社會性與商業性並重
B. 目前逐步推動以診斷關係群（diagnosis-related group, DRG）為依據的住院服務論病例計酬支付基準
C. 醫療服務供給者在保險未介入前，有優勢主導病人的醫療利用
D. 總額預算制是全民健保控制醫療支出成長的策略之一

正確答案：A. 規劃初期即確立保險的本質是社會性與商業性並重